Clinical trial inclusion criteria:
Age 18-65 years
History of snake bite with features of local envenomation with/without systemic features
Less than 24 hours since bite, AND
No prior antibiotic treatment

Annotated entities:
- Person: "Age"
- Value: "18-65 years"
- Condition: "snake bite"
- Condition: "local envenomation"
- Mood: "features of"
- Condition: "systemic features"
- Temporal: "Less than 24 hours since bite"
- Reference_point: "bite"
- Condition: "bite"
- Negation: "No"
- Temporal: "prior"
- Procedure: "antibiotic treatment"